Clinical trial exclusion criteria:
Patients with coagulopathy or under anti-coagulation therapy.
Gastrointestinal disease,
motion sickness.
diabetes mellitus.
Patients with preeclampsia,

Annotated entities:
- Condition: "coagulopathy"
- Procedure: "anti-coagulation therapy"
- Condition: "Gastrointestinal disease"
- Condition: "motion sickness"
- Condition: "diabetes mellitus"
- Condition: "preeclampsia"